Positive urine toxicology.

The above is a clinical trial exclusion criterion. Annotated with entity spans:
[Value: Positive] [Measurement: urine toxicology].